Clinical trial exclusion criterion:
study drug hypersensitivity

Annotated entities:
- Condition: "hypersensitivity"
- Drug: "study drug"